Siendo s la desviación estándar y N el número de datos, el error estándar de la media, Sm, de un conjunto de datos es: √𝑠
1. 𝑆𝑚 = 𝑁 .
2. 𝑆𝑚 = 𝑠 𝑁 . 𝑁
3. 𝑆𝑚 = √𝑠 . √𝑠
4. 𝑆𝑚 = √𝑁 . 𝑠
5. 𝑆𝑚 = √𝑁 .

Respuesta correcta: 5. 𝑆𝑚 = √𝑁 .